Clinical trial exclusion criterion:
Concomitant participation in other clinical trials

Entity relations:
- Has_temporal("participation in other clinical trials", "Concomitant")